下列局部麻醉藥物，何者不屬於ester type？
A. lidocaine
B. cocaine
C. tetracaine
D. procaine

正確答案：A. lidocaine